Clinical trial inclusion criterion:
Older than the age of legal consent (i.e. 18 years old)

Entity relations:
- Has_value("age", "Older than the age of legal consent")
- Subsumes("Older than the age of legal consent", "18 years old")